La estructura de la personalidad se puede organizar según:
1. El modelo tridimensional de R.B. Cattel.
2. La propuesta de cinco factores de Zuckerman.
3. Los cinco factores básicos de Cantor y Kihstrom.
4. Los dieciséis factores de H.J. Eysenck.
5. La teoría monorrasgo de Costa y McCrae.

Respuesta correcta: 2. La propuesta de cinco factores de Zuckerman.